History of alcohol or drug dependence or abuse in the last three years

The above is a clinical trial exclusion criterion. Annotated with entity spans:
History of [Condition: alcohol] or [Condition: drug dependence] or abuse [Temporal: in the last three years]